關於皮膚黑色素過度沉著（hypermelanosis）的敘述，下列何者錯誤？
A. 黑色素細胞增加或黑色素顆粒製造變多，皆會引起皮膚黑色素過度沉著
B. 汗斑（pityriasis versicolor）只會造成膚色變深，不會變淺
C. 轉移性黑色素癌可能造成全身皮膚黑色素過度沉著（universal melanosis）
D. 基因、賀爾蒙、紫外線等因素都可能會造成皮膚黑色素過度沉著

正確答案：B. 汗斑（pityriasis versicolor）只會造成膚色變深，不會變淺